Clinical trial inclusion criterion:
Abnormal nasal potential difference (NPD) as measured by a change in NPD in response to a low chloride solution and isoproterenol of less than -5 mV.

Entity relations:
- AND("nasal potential difference", "NPD")
- Has_value("nasal potential difference", "Abnormal")
- Has_value("nasal potential difference", "less than -5 mV")
- OR("Abnormal", "less than -5 mV")